Patient who are unwilling to participate

The above is a clinical trial exclusion criterion. Annotated with entity spans:
Patient who are [Observation: unwilling to participate]